Clinical trial exclusion criterion:
Liver enzymes (either AST, ALT, GGPT), or direct bilirubin exceeding 2 x upper limit of normal range

Annotated entities:
- Measurement: "Liver enzymes"
- Measurement: "AST"
- Measurement: "ALT"
- Measurement: "GGPT"
- Measurement: "direct bilirubin"
- Value: "exceeding 2 x upper limit of normal range"